Clinical trial exclusion criterion:
Positive for hepatitis B, hepatitis C or HIV infection

Entity relations:
- Has_value("hepatitis B", "Positive")
- Has_value("hepatitis C", "Positive")
- OR("hepatitis B", "hepatitis C", "HIV infection")